¿Cuál de los siguientes excipientes ejerce la función de plastificante en las cápsulas de gelatina dura?
1. Gelatina.
2. Dióxido de titanio.
3. Glicerina.
4. Bisulfito sódico.
5. Para aminobenzoato de metilo.

Respuesta correcta: 3. Glicerina.